一名 32 歲婦女因在右側乳房摸到腫塊而就醫，並接受切片檢查。她家人並未有乳癌病史。下列何種病理變化代表此位婦女未來有最高的機會得到侵襲性乳癌？
A. 頂漿腺變化（Apocrine change）
B. 異型乳腺管增生（Atypical ductal hyperplasia）
C. 複雜硬化性病變（Complex sclerosing lesion）
D. 纖維腺瘤併複雜表現（Fibroadenoma with complex features）

正確答案：B. 異型乳腺管增生（Atypical ductal hyperplasia）